Clinical trial inclusion criterion:
Clinical Dementia Rating (CDR) test inferior or equal to 1

Entity relations:
- Has_value("Clinical Dementia Rating (CDR) test", "inferior or equal to 1")